Clinical trial inclusion criterion:
patients scheduled for elective breast mastectomy or quadrantectomy

Annotated entities:
- Qualifier: "elective"
- Procedure: "mastectomy"
- Procedure: "breast quadrantectomy"